Clinical trial exclusion criterion:
A history of immunodeficiency.

Annotated entities:
- Condition: "history of immunodeficiency"